Clinical trial exclusion criterion:
birth weight < 2500 g

Entity relations:
- Has_value("birth weight", "< 2500 g")